Clinical trial exclusion criterion:
Received radiation to more than 10% of bone.

Entity relations:
- AND("bone", "radiation")
- Has_value("bone", "more than 10%")